Clinical trial exclusion criterion:
Women who are breastfeeding

Annotated entities:
- Pregnancy_considerations: "Women who are breastfeeding"